Clinical trial inclusion criterion:
Recipient of a French social security scheme

Annotated entities:
- Non-query-able: "Recipient of a French social security scheme"